下列對於隨機分派（randomization）的描述何者錯誤？
A. 可透過亂數表進行研究對象的分組
B. 目的是讓世代研究之暴露組與非暴露組的研究對象有相同背景
C. 為避免干擾，原則上不讓研究對象、資料蒐集者知道分組的情形
D. 病例對照研究法無法進行隨機分派

正確答案：B. 目的是讓世代研究之暴露組與非暴露組的研究對象有相同背景